下列那一項有關副甲狀腺素（parathyroid hormone, PTH）的敘述是正確的？
A. PTH 的生物活性主要來自於碳端（carboxyl-terminal）的 34 個胺基酸
B. 血液中 PTH(1-84)的廓清速率比碳端 PTH 片段的廓清速率慢
C. 調控 PTH 分泌的最重要因子是血磷濃度
D. 噬骨細胞（osteoclast）沒有 PTH 接受器

正確答案：D. 噬骨細胞（osteoclast）沒有 PTH 接受器